Pregnant women or women who are breastfeeding.

The above is a clinical trial exclusion criterion. Annotated with entity spans:
P[Pregnancy_considerations: regnant women or women who are breastfeeding].